What effect does Methylsulfonylmethane (MSM) have on inflammation?

Methylsulfonylmethane (MSM) is a sulfur-based compound that is purported to have anti-inflammatory and inflammation-reducing effects.  URL_0